Clinical trial inclusion criteria:
patients = 70 years of age, undergoing a noncardiac surgical procedure under general anesthesia, with an anticipated duration of postoperative admission of at least 2 days.

Annotated entities:
- Person: "age"
- Value: "= 70 years"
- Procedure: "noncardiac surgical procedure"
- Procedure: "general anesthesia"
- Mood: "anticipated"
- Measurement: "duration of postoperative admission"
- Value: "at least 2 days"
- Procedure: "admission"
- Temporal: "postoperative"